Clinical trial exclusion criterion:
Progressive, unstable or uncontrolled clinical conditions.

Annotated entities:
- Qualifier: "uncontrolled"
- Qualifier: "unstable"
- Qualifier: "Progressive"
- Condition: "clinical conditions"